Uncontrolled narrow-angle glaucoma

The above is a clinical trial exclusion criterion. Annotated with entity spans:
[Qualifier: Uncontrolled] [Condition: narrow-angle glaucoma]